Acute heart failure

The above is a clinical trial exclusion criterion. Annotated with entity spans:
[Condition: Acute heart failure]